Clinical trial inclusion criterion:
moderate or severe hepatic dysfunction (Child Pugh B or C)

Annotated entities:
- Condition: "hepatic dysfunction"
- Qualifier: "severe"
- Qualifier: "moderate"
- Measurement: "Child Pugh"
- Value: "B or C"